Clinical trial exclusion criterion:
clinically significant medical or neurologic condition or neurocognitive dysfunction that would affect function and/or task performance and/or interfere with the study protocol

Entity relations:
- Has_qualifier("medical condition", "clinically significant")
- OR("medical condition", "neurologic condition", "neurocognitive dysfunction")